Clinical trial exclusion criterion:
Meet one of the above RA flare requirements

Entity relations:
- Has_multiplier("RA flare requirements", "one of")